Clinical trial exclusion criterion:
Presence of psychiatric disorder or intake of anti-depressive or anti-psychotic agents with the exception of benzodiazepines and SSRIs/SNRI's (selective serotonin reuptake inhibitor)

Entity relations:
- Has_negation("benzodiazepines", "with the exception of")
- AND("anti-depressive agents", "benzodiazepines")
- AND("psychiatric disorder", "anti-depressive agents")
- OR("benzodiazepines", "SSRIs", "SNRI's")
- OR("anti-depressive agents", "anti-psychotic agents")